Clinical trial exclusion criterion:
14. Mental impairment that may compromise compliance with the requirements of the study.

Entity relations:
- Has_context("Mental impairment", "compromise compliance")